Clinical trial inclusion criterion:
Foveal subretinal fluid (SRF), on optical coherence tomography (OCT), at Baseline Examination;

Entity relations:
- AND("optical coherence tomography (OCT)", "Foveal subretinal fluid (SRF)")
- Has_temporal("optical coherence tomography (OCT)", "at Baseline Examination")
- Has_index("at Baseline Examination", "Baseline Examination")